Clinical trial exclusion criterion:
patients with known allergy to study medications.

Entity relations:
- AND("allergy", "study medications")